Exclusions Based on Other Medical Conditions

The above is a clinical trial exclusion criterion. Annotated with entity spans:
[Parsing_Error: Exclusions Based on Other Medical Conditions]